What antibiotic is currently used as the standard of care for Clostridium Difficile infection as of 2018

Fidaxomicin has recently been introduced as a new antibiotic that has been shown to significantly reduce the recurrence of this infection.Fidaxomicin is a new antibiotic used to treat Clostridium difficile infection (CDI)